Clinical trial exclusion criterion:
Patient has a current malignancy or a history of malignancy (within the past 5 years), except hepatocellular carcinoma within UCSF Criteria and basal or non-metastatic squamous cell carcinoma of skin that has been treated successfully.

Entity relations:
- Has_temporal("history of malignancy", "within the past 5 years")
- Has_qualifier("squamous cell carcinoma of skin", "non-metastatic")
- AND("UCSF Criteria", "hepatocellular carcinoma")
- Has_mood("UCSF Criteria", "treated successfully")
- Has_negation("UCSF Criteria", "except")
- Has_mood("basal cell carcinoma of skin", "treated successfully")
- Has_negation("basal cell carcinoma of skin", "except")
- OR("basal cell carcinoma of skin", "squamous cell carcinoma of skin")
- OR("malignancy", "history of malignancy")